El virus respiratorio sincitial es un:
1. Ortomixovirus.
2. Filovirus.
3. Parvovirus.
4. Togavirus.
5. Paramixovirus.

Respuesta correcta: 5. Paramixovirus.